Clinical trial exclusion criterion:
The patient has participated in other experimental therapy studies within 30 days

Annotated entities:
- Non-query-able: "The patient has participated in other experimental therapy studies within 30 days"